下列何種卵巢腫瘤最易兩側同時發生？
A. 漿液性腫瘤（serous tumor）
B. 黏液性腫瘤（mucinous tumor）
C. 顆粒層細胞瘤（granulosa cell tumor）
D. 皮樣囊腫（dermoid cyst）

正確答案：A. 漿液性腫瘤（serous tumor）